Clinical trial exclusion criterion:
Patient has received a liver transplant from a decrease donor > 70 years of age

Annotated entities:
- Procedure: "liver transplant"
- Person: "donor"
- Value: "> 70 years"
- Person: "age"